一位 30 歲女性，已經懷有 3 個月身孕，因為下背痛前來就診。在安排物理治療時，下列那一個治療項目絕對不可以施用於其背部？
A. 熱敷（hot packing）
B. 紅外線（infrared）
C. 干擾波（interferential current）
D. 短波（shortwave）

正確答案：D. 短波（shortwave）